Clinical trial exclusion criteria:
Diagnosis of a psychotic disorder.
History of, or current, open head brain trauma. Candidates with any metal, shrapnel or other similar objects in the head that could affect the QEEG
History of: craniotomy, cerebral metastases, cerebrovascular accident; current diagnosis of seizure disorder, schizophrenia, schizo-affective disorder, dementia, mental retardation, or major depression with psychotic features; or use of depot neuroleptics in last 12 months.
Uncontrolled thyroid disorders.
Known pregnancy and/or lactation, or intent to become pregnant during this study.
Chronic or acute pain requiring prescription pain medication(s) (narcotic or synthetic narcotic)
Participation in any other therapeutic drug study within 60 days preceding inclusion.

Annotated entities:
- Condition: "psychotic disorder"
- Condition: "open head brain trauma"
- Temporal: "current"
- Temporal: "History"
- Device: "metal"
- Device: "shrapnel"
- Device: "objects in the head"
- Procedure: "QEEG"
- Condition: "affect"
- Procedure: "craniotomy"
- Condition: "cerebral metastases"
- Condition: "cerebrovascular accident"
- Condition: "seizure disorder"
- Condition: "schizophrenia"
- Condition: "schizo-affective disorder"
- Condition: "dementia"
- Condition: "mental retardation"
- Condition: "major depression"
- Condition: "psychotic features"
- Drug: "depot neuroleptics"
- Temporal: "in last 12 months"
- Temporal: "History"
- Condition: "thyroid disorders"
- Qualifier: "Uncontrolled"
- Pregnancy_considerations: "Known pregnancy and/or lactation, or intent to become pregnant during this study."
- Qualifier: "acute"
- Qualifier: "Chronic"
- Condition: "pain"
- Drug: "prescription pain medication"
- Drug: "narcotic"
- Drug: "synthetic narcotic"
- Competing_trial: "Participation in any other therapeutic drug study within 60 days preceding inclusion."